Cases of rectal tumours below 12cm from anal verge, or locally advanced tumours invading blood vessels, nerves or bone.

The above is a clinical trial exclusion criterion. Annotated with entity spans:
Cases of [Condition: rectal tumours] [Qualifier: below 12cm from anal verge], or [Condition: locally advanced tumours] [Condition: invading blood vessels], [Condition: nerves] or [Condition: bone].